Clinical trial inclusion criterion:
Diagnosed with GAD according to DSM-IV

Entity relations:
- AND("GAD", "DSM-IV")